Clinical trial exclusion criterion:
Oral hypoglycemic or hormonal therapy either currently or in the preceding 3 months.

Annotated entities:
- Procedure: "hormonal therapy"
- Procedure: "hypoglycemic therapy"
- Qualifier: "Oral"
- Temporal: "preceding 3 months"